Clinical trial exclusion criterion:
mechanical valve prosthesis;

Annotated entities:
- Device: "mechanical valve prosthesis"